Clinical trial exclusion criterion:
Patients with NOAC preference apart from preference consistent with current cluster randomized NOAC.

Entity relations:
- multi("NOAC preference", "NOAC")